What is the function of the Eyeless associated gene in Drosophila?

Eyeless (ey) also known as Pax6, is one of the most critical transcription factors for initiating the entire eye development in Drosophila.